Clinical trial exclusion criterion:
Subject has renal dysfunction with glomerular filtration rate < 60 ml / min.

Annotated entities:
- Condition: "renal dysfunction"
- Measurement: "glomerular filtration rate"
- Value: "< 60 ml / min"